罹患 Alzheimer 氏病的病人，死後解剖時下列何者最符合腦的表現？
A. 腦重 1010 公克
B. 腦室縮小
C. 腦迴寬而扁平
D. 腦溝變窄

正確答案：A. 腦重 1010 公克